𝐸𝑎 Según la ecuación de Arrhenius, k =𝐴𝑒     𝑅𝑇
1. La constante cinética (k) disminuye al aumentar la temperatura.
2. El factor preexponencial (A) es adimensional.
3. En reacciones con elevada Energía de activación (Ea), la constante cinética (k) depende enormemente de la temperatura.
4. El factor preexponencial (A) y la constante cinética (k) son inversamente proporcionales.
5. Los parámetros de Arrhenius son la constante cinética (k) y el factor preexponencial (A).

Respuesta correcta: 3. En reacciones con elevada Energía de activación (Ea), la constante cinética (k) depende enormemente de la temperatura.